4. Patients with severe cardiopulmonary cerebral disease, and in the failure state

The above is a clinical trial exclusion criterion. Annotated with entity spans:
4. Patients with [Qualifier: severe] [Condition: cardiopulmonary cerebral disease], and in the failure state